Which lncRNAs are induced by heatshock?

Malat1, papas, long noncoding rnas, circrna, neat1 and mirna are induced by heathock.